下列關於輔脂酶（colipase）之敘述，何者正確？
A. 位於小腸上皮細胞膜上
B. 負責消化三酸甘油酯（triglycerides）
C. 可將脂肪酶原（prolipase）轉化成脂肪酶（lipase）
D. 避免脂肪酶（lipase）受到膽鹽的影響而降低其活性

正確答案：D. 避免脂肪酶（lipase）受到膽鹽的影響而降低其活性